Clinical trial inclusion criterion:
Ankle-brachial index above 0,40 or presence of palpable pulses in arteria dorsalis pedes and/or arteria tibialis posterior

Entity relations:
- Has_value("Ankle-brachial index", "above 0,40")
- Has_index("palpable pulses", "arteria dorsalis pedes")
- OR("arteria dorsalis pedes", "arteria tibialis posterior")
- OR("Ankle-brachial index", "palpable pulses")